李太太，今年 57 歲，過去無特殊內科病史。因腹脹 2 個月、食慾不振來院求診。於急診室發現病人 有大量腹水，抽取腹水後發現有腺癌細胞。下列那一項腫瘤指標較不具臨床意義？
A. CEA
B. CA125
C. SCC
D. CA19-9

正確答案：C. SCC